8 個多月大的男嬰，因左前胸藍色腫瘤來診，病理顯示為類卡波西血管內皮細胞瘤（Kaposiform hemangioendothelioma），白血球數目（WBC count）為 8,700/mm3，血紅素濃度（Hb）為 10.5 g/dL，血小板（platelets）數目為 32,000/mm3，其他理學檢查無異常；數天後男嬰身上發現出血點，且血小 板（platelets）數目降為 12,000/mm3，前凝血酵素時間（prothrombin time）及活化凝血酵素時間（partial thromboplastin time, PTT）皆延長，經檢查無感染或休克情況。病人最可能發生下列那一種情況？
A. 免疫性紫斑症（immune thrombocytopenic purpura）
B. 類過敏性紫斑症（Henoch-Schönlein purpura or anaphylactoid purpura）
C. Kasabach-Merritt 症候群
D. 腫瘤骨髓轉移

正確答案：C. Kasabach-Merritt 症候群